腹股溝韌帶（inguinal ligament）是下列何肌的腱膜（aponeurosis）轉折所形成？
A. 腹直肌
B. 腹外斜肌
C. 腹內斜肌
D. 腹橫肌

正確答案：B. 腹外斜肌